橈動脈經過解剖學鼻煙盒（anatomical snuff box）後，穿過下列何者進入手掌？
A. 對掌拇肌（opponens pollicis）
B. 第一掌側骨間肌（lst. palmar interosseous m.）
C. 第一背側骨間肌（lst. dorsal interosseous m.）
D. 外展拇短肌（abductor pollicis brevis）

正確答案：C. 第一背側骨間肌（lst. dorsal interosseous m.）